Clinical trial exclusion criterion:
Has used e-cigarettes and marijuana <1 years

Annotated entities:
- Observation: "used e-cigarettes"
- Observation: "used marijuana"
- Temporal: "<1 years"